Clinical trial inclusion criterion:
Parents able to provide written informed consent and adolescents must additionally provide assent.

Annotated entities:
- Person: "Parents"
- Observation: "provide written informed consent"
- Person: "adolescents"
- Observation: "provide assent"